Clinical trial inclusion criterion:
Males or non-pregnant, non-nursing females between the ages of 2-65 years

Entity relations:
- Has_value("ages", "2-65 years")
- OR("Males", "females")